Clinical trial inclusion criterion:
Subjects have following investigations within 1 month prior to enrolment.

Annotated entities:
- Non-representable: "Subjects have following investigations within 1 month prior to enrolment."
- Temporal: "within 1 month prior to enrolment"